Clinical trial inclusion criterion:
Probable or definite diagnosis of autoimmune hepatitis according to the International Autoimmune Hepatitis Study Group criteria

Entity relations:
- AND("International Autoimmune Hepatitis Study Group criteria", "autoimmune hepatitis")